Clinical trial inclusion criterion:
2. Evidence on brain MRI of white matter hyperintensities (leukoaraiosis of moderate or severe degree according to the modified Fazekas visual scale and/or presence of lacunar infarcts).

Entity relations:
- Has_value("modified Fazekas visual scale", "moderate or severe degree")
- AND("leukoaraiosis", "modified Fazekas visual scale")
- Has_context("brain MRI", "white matter hyperintensities")
- Subsumes("white matter hyperintensities", "leukoaraiosis")
- OR("modified Fazekas visual scale", "lacunar infarcts")